在研究職業皮膚病時，橫斷式研究（cross-sectional study）與縱貫式研究（longitudinal study）的主要不同點是：
A. 橫斷式研究觀察較大的研究族群
B. 橫斷式研究較不易判斷暴露與疾病發生的先後次序
C. 橫斷式研究無法同時收集暴露與疾病的資料
D. 橫斷式研究可以計算勝算比（odds ratio）

正確答案：B. 橫斷式研究較不易判斷暴露與疾病發生的先後次序